Clinical trial exclusion criterion:
Patients that have a known psychiatric or substance abuse disorder that would interfere with cooperation with the requirements of the trial.

Annotated entities:
- Condition: "psychiatric disorder"
- Condition: "substance abuse disorder"
- Subjective_judgement: "Patients that have a known psychiatric or substance abuse disorder that would interfere with cooperation with the requirements of the trial."